Clinical trial exclusion criterion:
Acute or chronic disease, as diabetes, heart disease, systemic arterial hypertension;

Annotated entities:
- Condition: "chronic disease"
- Condition: "diabetes"
- Condition: "Acute disease"
- Condition: "heart disease"
- Condition: "systemic arterial hypertension"